9. Prior therapy with FLT3 inhibitors is permitted, except previous treatment with AC220.

The above is a clinical trial inclusion criterion. Annotated with entity spans:
9. Prior [Procedure: therapy] with [Drug: FLT3 inhibitors] is [Mood: permitted], [Negation: except] previous [Procedure: treatment] with [Drug: AC220].